Clinical trial exclusion criterion:
History of transurethral resection of the prostate (TURP), open prostate surgery, or radiofrequency or microwave therapies

Annotated entities:
- Procedure: "transurethral resection of the prostate (TURP)"
- Procedure: "open prostate surgery"
- Procedure: "radiofrequency"
- Procedure: "microwave therapies"